Clinical trial exclusion criterion:
Age < 45 or > 55 years.

Entity relations:
- Has_value("Age", "< 45 or > 55 years")